Clinical trial inclusion criterion:
Has a potential post-operative pinhole corrected Snellen VA of at least 20/200 or better in both eyes

Entity relations:
- Has_value("pinhole corrected Snellen VA", "at least 20/200 or better")
- Has_qualifier("at least 20/200 or better", "both eyes")